Clinical trial exclusion criterion:
Unexplained abdominal pain

Annotated entities:
- Qualifier: "Unexplained"
- Condition: "abdominal pain"